下列何者不是繼發性腎上腺功能不全（secondary adrenal insufficiency）的臨床表徵？
A. 色素過多（hyperpigmentation）
B. 起立性低血壓（orthostatic hypotension）
C. 全身無力（weakness）
D. 電解質通常正常

正確答案：A. 色素過多（hyperpigmentation）